What is the genetic basis of propionic acidemia?

Mutations in the PCCA or PCCB genes, encoding both subunits of propionyl-CoA carboxylase.